La tinción con verde malaquita (SchafferFulton) se utiliza para visualizar:
1. Cápsulas.
2. Fimbrias.
3. Flagelos.
4. Esporas.

Respuesta correcta: 4. Esporas.